4 歲女童，因為口腔出現十數個潰瘍而就醫，如果該女童有下列那一項特徵，則可能並非腸病毒感染？
A. 潰瘍於口腔後半部較多
B. 發燒超過 3 天
C. 手掌與腳掌出現水泡
D. 牙齦浮腫出血

正確答案：D. 牙齦浮腫出血